Any intraocular inflammation in the study eye present during the screening slit lamp examination

The above is a clinical trial exclusion criterion. Annotated with entity spans:
Any [Value: intraocular inflammation] in the study eye present [Temporal: during the screening slit lamp examination]